一位 51 歲的公司女職員，停經已 2 年，過去並無特殊疾病史，身高 156 公分、體重 66.2 公斤，平常無運動習慣，不抽菸且不喝酒。從實證醫學的角度，下列何項檢查不適合作為此受檢者的癌症篩檢？
A. 乳房攝影
B. 子宮頸抹片檢查
C. 大便潛血反應
D. 腹部超音波檢查

正確答案：D. 腹部超音波檢查